Clinical trial inclusion criterion:
Moderate or severe claudication (Rutherford category 2 or 3)

Annotated entities:
- Qualifier: "Moderate"
- Qualifier: "severe"
- Condition: "claudication"
- Measurement: "Rutherford category"
- Value: "2 or 3"